Clinical trial exclusion criterion:
Patients with chronic immunosuppression (such as HIV/AIDS).

Entity relations:
- Has_qualifier("immunosuppression", "chronic")
- Subsumes("immunosuppression", "HIV/AIDS")